Clinical trial exclusion criterion:
Subject has symptomatic carotid stenosis.

Annotated entities:
- Condition: "carotid stenosis"
- Qualifier: "symptomatic"